Enrolment in any activity requiring a blood donation greater than 50 mL during the period starting 30 days before the first study visit (Day -83, Day -60 or Day -30) or for the duration of the study period.

The above is a clinical trial exclusion criterion. Annotated with entity spans:
[Non-representable: Enrolment in any activity requiring a] [Procedure: blood donation] [Multiplier: greater than 50 mL] [Temporal: during the period starting 30 days before the first study visit] (Day -83, Day -60 or Day -30) or [Temporal: for the duration of the study period].